Clinical trial inclusion criteria:
Male and/or female patients from 30-80 years of age with a diagnosis of Type 2 diabetes (WHO criteria).
Incipient and established diabetic nephropathy (urinary albumin excretion ≥ 100 mg/day but ≤ 2000 mg/day).
Glomerular filtration rate (GFR) ≥ 40 ml/min (estimated using Modification of Diet in Renal Disease (MDRD) formula) in the last 4 months.
Female patients must be postmenopausal or must have had a bilateral oophorectomy or must have been surgically sterilized or hysterectomized at least 6 months prior to screening.
To be eligible patients must fulfill the following criteria: Patients on ongoing hypertensive therapy must have a blood pressure ≥ 135/85 mm Hg but lower than 170/105 mm Hg at baseline (Day -1) AND patients must be on stable antihypertensive medications for at least 8 weeks prior to baseline (Day -1).; Newly diagnosed hypertensive patients must have a blood pressure ≥ 135/85 mm Hg but lower than 170/105 mm Hg at baseline (Day -1).
Patients must be on stable hypoglycemic medications for at least 8 weeks prior to Visit 2 ( Day -1).
Patients must be willing and medically able to discontinue all Angiotensin-converting enzyme inhibitor (ACEI), Angiotensin receptor blocker (ARB), aldosterone receptor antagonist and potassium sparing diuretic medications for the duration of the study.
Oral body temperature within the range 35.0-37.5 °C
Able to provide written informed consent prior to study participation. .
Able to communicate well with the investigator and comply with the requirements of the study.

Annotated entities:
- Value: "30-80 years"
- Condition: "Type 2 diabetes"
- Person: "of age"
- Condition: "diabetic nephropathy"
- Value: "≤ 2000 mg/day"
- Value: "≥ 100 mg/day"
- Measurement: "urinary albumin excretion"
- Measurement: "Glomerular filtration rate (GFR)"
- Value: "≥ 40 ml/min"
- Qualifier: "Modification of Diet in Renal Disease (MDRD) formula"
- Temporal: "in the last 4 months"
- Person: "Female"
- Condition: "postmenopausal"
- Procedure: "bilateral oophorectomy"
- Procedure: "surgically sterilized"
- Procedure: "hysterectomized"
- Temporal: "at least 6 months prior to screening"
- Procedure: "hypertensive therapy"
- Measurement: "blood pressure"
- Value: "≥ 135/85 mm Hg"
- Value: "lower than 170/105 mm Hg"
- Drug: "antihypertensive medications"
- Qualifier: "stable"
- Temporal: "at least 8 weeks prior to baseline"
- Qualifier: "Newly diagnosed"
- Condition: "hypertensive patients"
- Measurement: "blood pressure"
- Value: "≥ 135/85 mm Hg"
- Value: "lower than 170/105 mm Hg"
- Temporal: "at baseline (Day -1)"
- Reference_point: "baseline (Day -1)"
- Reference_point: "baseline"
- Drug: "hypoglycemic medications"
- Temporal: "at least 8 weeks prior to Visit 2"
- Qualifier: "stable"
- Reference_point: "Visit 2"
- Non-query-able: "Patients must be willing and medically able to discontinue all Angiotensin-converting enzyme inhibitor (ACEI), Angiotensin receptor blocker (ARB), aldosterone receptor antagonist and potassium sparing diuretic medications for the duration of the study."
- Measurement: "Oral body temperature"
- Value: "35.0-37.5 °C"
- Observation: "written informed consent"
- Temporal: "prior to study participation"
- Reference_point: "study participation"
- Observation: "Able to communicate well"
- Observation: "comply with the requirements of the study"